Clinical trial exclusion criterion:
Uncontrolled Type II diabetes mellitus (Hemaglobin subtype A1C (HbA1C) >11 %)

Entity relations:
- Has_value("Hemaglobin subtype A1C (HbA1C)", ">11 %")
- Subsumes("Uncontrolled", "Hemaglobin subtype A1C (HbA1C)")
- Has_qualifier("Type II diabetes mellitus", "Uncontrolled")